Clinical trial exclusion criterion:
16. Childbearing-aged female subject who is unmarried or dose not bear child;

Annotated entities:
- Person: "female"
- Observation: "unmarried"
- Observation: "bear child"
- Negation: "not"